La expresión de un gen eucariota en procariotas requiere:
1. La presencia de intrones.
2. Un promotor eucariota.
3. Una secuencia Shine-Delgarno (SD) en el mRNA.
4. La utilización de cepas bacterianas con sus ribosomas modificados genéticamente.

Respuesta correcta: 3. Una secuencia Shine-Delgarno (SD) en el mRNA.